腹腔鏡膽囊切除手術之絕對禁忌症為何？
A. 病態性肥胖症
B. 急性膽囊炎
C. 瀰漫性腹膜炎
D. 婦女以前接受過剖腹產

正確答案：C. 瀰漫性腹膜炎